Clinical trial exclusion criterion:
Clinically positive axillary nodes

Entity relations:
- Has_qualifier("axillary nodes", "positive")